Clinical trial exclusion criterion:
Pregnant or lactational women.

Entity relations:
- OR("Pregnant", "lactational")